Clinical trial exclusion criterion:
Life expectancy less than 360 days (12 months)

Annotated entities:
- Observation: "Life expectancy"
- Value: "less than 360 days"
- Value: "less than 12 months"